Clinical trial exclusion criterion:
Resting bradycardia (< 50 beats/min), frequent multifocal PVCs, complex ventricular arrhythmia, sustained SVT

Entity relations:
- Has_value("Resting bradycardia", "< 50 beats/min")
- Has_multiplier("multifocal PVCs", "frequent")
- OR("Resting bradycardia", "multifocal PVCs", "complex ventricular arrhythmia", "sustained SVT")